Clinical trial inclusion criterion:
Patients with functional dyspepsia that fulfill Rome III criteria with inadequate relief of dyspeptic symptoms

Entity relations:
- Has_qualifier("dyspeptic symptoms", "inadequate relief")
- AND("functional dyspepsia", "dyspeptic symptoms")
- Has_qualifier("functional dyspepsia", "Rome III criteria")